一位 50 歲女性因手腕骨折來門診諮詢。她過去曾服用避孕藥 20 年，有肥胖及甲狀腺機能亢進等病 史，育有二子，皆餵母乳六個月。根據病史，何者會增加骨質疏鬆症的風險？
A. 口服避孕藥之使用
B. 肥胖症
C. 甲狀腺機能亢進
D. 餵母乳

正確答案：C. 甲狀腺機能亢進